Clinical trial exclusion criterion:
Patients < 18 years of age and >70 years of age

Annotated entities:
- Person: "age"
- Value: "< 18 years"
- Person: "age"
- Value: ">70 years"